下列那一對顱神經於鼻竇炎併發海綿靜脈竇栓塞時最不可能受影響？
A. 第三對
B. 第四對
C. 第五對
D. 第七對

正確答案：D. 第七對